下列有關人體脊柱（vertebral column）的彎曲，何者正確？
A. 頸部與胸部向前凸
B. 頸部與腰部向前凸
C. 胸部與薦部向前凸
D. 腰部與薦部向後凸

正確答案：B. 頸部與腰部向前凸